造成胎兒心跳早期性減速（early deceleration）的常見原因為何？
A. 胎頭壓迫
B. 臍帶壓迫
C. 胎兒缺氧
D. 母親酸血症

正確答案：A. 胎頭壓迫